與電動輪椅比較，下列何者為手動輪椅的優點？
A. 可長程不疲勞的旅行
B. 容易運送
C. 可穿越粗糙地形
D. 可避免反覆性的上肢傷害

正確答案：B. 容易運送